一位 50 歲男性，有長期抽菸及高血壓病史，因胸悶冒冷汗至急診室就診，血壓 110/70 mmHg，呼吸 26 次/分，體溫 37.2℃，脈搏 84 次/分，心電圖在導程V1～V6出現ST波段上升，而導程II、III及aVF 出現ST波段下降，其診斷應為：
A. 急性前壁心肌梗塞
B. 急性後壁心肌梗塞
C. 急性下壁心肌梗塞
D. 心肌炎

正確答案：A. 急性前壁心肌梗塞